Severe Hypertension Grade 3 WHO classification (Mean Sitting Diastolic Blood Pressure (MSDBP) 110 mmHg and/or Mean Sitting Systolic Blood Pressure MSSBP 180 mmHg)

The above is a clinical trial exclusion criterion. Annotated with entity spans:
[Condition: Severe Hypertension] [Measurement: Grade] [Value: 3] WHO classification ([Measurement: Mean Sitting Diastolic Blood Pressure (MSDBP)] [Value: 110 mmHg] and/or [Measurement: Mean Sitting Systolic Blood Pressure MSSBP] [Value: 180 mmHg])